Clinical trial exclusion criterion:
Be allergic or have contraindications to nitroglycerin or other nitrates.

Annotated entities:
- Condition: "allergic"
- Drug: "nitroglycerin"
- Drug: "nitrates"
- Condition: "contraindications"